Clinical trial exclusion criteria:
Age less than 10 years or greater than 55 years, at time of consent
Estimated IQ < 70
Uncontrolled epilepsy (seizure within 6 months prior to consent)
4. Presence of medical conditions that might interfere with participation, or where participation would be contraindicated
History of neurological injury: head trauma, poorly-controlled seizure disorder (seizure within the preceding six months), stroke, prior neurosurgery, or under the care of a neurologist or neurosurgeon as determined by interview
History of claustrophobia
Implanted or irremovable metal in the body (including certain tattoos and permanent make-up)
Current pregnancy (as verified by testing prior to both initial dose administration of citalopram or placebo and prior to magnetic resonance imaging) due to the risk that may be associated with SSRI treatment and magnetic resonance imaging on fetal health
Medical contraindications to SSRI therapy as determined by history (including induction of mania or hypomania during SSRI therapy, or known drug allergy)
Concomitant medication that would interfere with study participation
Prior history of citalopram treatment failure at appropriate doses and duration
Prior history of treatment failure to two previous SSRI trials at appropriate doses and duration
Ongoing need for psychoactive medication other than study medication [excepting stable doses (greater than three months duration) of anticonvulsant medication for seizure disorder, or diphenhydramine (Benadryl®)for sleep]

Annotated entities:
- Person: "Age"
- Value: "less than 10 years"
- Value: "greater than 55 years"
- Temporal: "at time of consent"
- Observation: "consent"
- Reference_point: "consent"
- Measurement: "Estimated IQ"
- Value: "< 70"
- Condition: "Uncontrolled epilepsy"
- Value: "within 6 months prior to consent"
- Condition: "seizure"
- Context_Error: "Presence of medical conditions that might interfere with participation, or where participation would be contraindicated"
- Condition: "neurological injury"
- Temporal: "History"
- Condition: "head trauma"
- Condition: "seizure disorder"
- Qualifier: "poorly-controlled"
- Condition: "seizure"
- Temporal: "within the preceding six months"
- Condition: "stroke"
- Condition: "neurosurgery"
- Temporal: "prior"
- Observation: "under the care of a neurologist"
- Observation: "under the care of a neurosurgeon"
- Condition: "claustrophobia"
- Temporal: "History"
- Device: "Implanted metal in the body"
- Device: "irremovable metal in the body"
- Condition: "pregnancy"
- Temporal: "Current"
- Not_a_criteria: "(as verified by testing prior to both initial dose administration of citalopram or placebo and prior to magnetic resonance imaging) due to the risk that may be associated with SSRI treatment and magnetic resonance imaging on fetal health"
- Condition: "contraindications to SSRI therapy"
- Condition: "mania"
- Temporal: "during SSRI therapy"
- Condition: "hypomania"
- Condition: "drug allergy"
- Temporal: "history"
- Procedure: "SSRI therapy"
- Context_Error: "Concomitant medication that would interfere with study participation"
- Drug: "citalopram"
- Temporal: "history"
- Temporal: "Prior"
- Procedure: "treatment"
- Qualifier: "failure"
- Context_Error: "Prior history of citalopram treatment failure at appropriate doses and duration"
- Non-query-able: "Prior history of treatment failure to two previous SSRI trials at appropriate doses and duration"
- Drug: "psychoactive medication"
- Drug: "study medication"
- Subjective_judgement: "stable doses"
- Temporal: "greater than three months"
- Drug: "anticonvulsant medication"
- Condition: "seizure disorder"
- Drug: "diphenhydramine"
- Negation: "other than"
- Negation: "excepting"